結腸癌之病理分期 Dukes' stage C，是指癌細胞：
A. 已侵犯腸肌層（muscularis propria），無淋巴結轉移
B. 已有肝臟轉移
C. 已侵犯腸系膜淋巴結
D. 仍侷限於腸黏膜

正確答案：C. 已侵犯腸系膜淋巴結